Clinical trial inclusion criteria:
Symptoms of ischaemia.
New or presumed new significant ST-T wave changes
Development of pathological Q waves on ECG.
Imaging evidence of new or presumed new loss of viable myocardium or regional wall motion abnormality.

Annotated entities:
- Mood: "Symptoms"
- Condition: "ischaemia"
- Qualifier: "significant"
- Multiplier: "New"
- Multiplier: "presumed new"
- Condition: "ST-T wave changes"
- Condition: "pathological Q waves"
- Procedure: "ECG"
- Procedure: "Imaging"
- Condition: "evidence"
- Multiplier: "presumed new"
- Multiplier: "new"
- Condition: "loss of viable myocardium"
- Condition: "regional wall motion abnormality"